Clinical trial exclusion criterion:
Decreased blood pressure, causing symptoms (symptomatic hypotension),

Annotated entities:
- Condition: "blood pressure"
- Qualifier: "Decreased"
- Condition: "symptoms"
- Condition: "hypotension"
- Qualifier: "symptomatic"